¿Qué fármaco de los que se relacionan a continuación, está incluido dentro del grupo de los Glucocorticoides de acción intermedia?:
1. Clorpropamida.
2. Estradiol.
3. Metformina.
4. Carbamacepina.
5. Prednisolona.

Respuesta correcta: 5. Prednisolona.